老年人的睡眠相（sleep phase）變化的特徵為：
A. 前移（advanced sleep phase）
B. 後移（delayed sleep phase）
C. 不規則
D. 與一般成年人無異

正確答案：A. 前移（advanced sleep phase）